Clinical trial exclusion criterion:
Lack a mobile phone and/or unable to return for follow-up clinic visits during the next 24 months

Annotated entities:
- Post-eligibility: "Lack a mobile phone and/or unable to return for follow-up clinic visits during the next 24 months"